Patients using monoamine oxidase inhibitors.

The above is a clinical trial exclusion criterion. Annotated with entity spans:
Patients using [Drug: monoamine oxidase inhibitors].